Clinical trial exclusion criterion:
Renal dysfunction (CrCl < 30ml/min).

Entity relations:
- Has_value("CrCl", "< 30ml/min")
- Subsumes("Renal dysfunction", "CrCl")